一個病人血清學檢查發現 A 型肝炎病毒（HAV）IgM 抗體呈陽性反應時，則下列何者正確？
A. 可能最近的輸血得到感染
B. 可能會得到慢性肝炎（chronic hepatitis）
C. 可能會得到肝癌
D. 可能在最近數星期內得到感染

正確答案：D. 可能在最近數星期內得到感染